Clinical trial exclusion criterion:
Regular smoker (> 5 cigarettes, > 1 pipeful or > 1 cigar per day)

Annotated entities:
- Condition: "Regular smoker"
- Multiplier: "> 5"
- Observation: "cigarettes"
- Multiplier: "> 1 per day"
- Observation: "cigar"
- Multiplier: "> 1"
- Observation: "pipeful"